一位 54 歲高血壓病患，於聽診時發現其心尖位置之第一心音（first heart sound）前有一低頻短音，此時病人常會伴隨有下列何種現象？
A. 心電圖出現心房顫動（atrial fibrillation）
B. 胸部 X 光出現右心室擴大
C. 心臟超音波發現左心室肥厚
D. 左側胸骨下緣出現收縮期心雜音

正確答案：C. 心臟超音波發現左心室肥厚